Clinical trial inclusion criterion:
History of a liver biopsy showing cirrhosis (e.g. Metavir score = 4 or Ishak score > 5)

Annotated entities:
- Procedure: "liver biopsy"
- Condition: "cirrhosis"
- Measurement: "Metavir score"
- Measurement: "Ishak score"
- Value: "= 4"
- Value: "> 5"